Clinical trial exclusion criterion:
The patients who have more than or equal to 3 target lesions

Annotated entities:
- Multiplier: "more than or equal to 3"
- Condition: "target lesions"